Clinical trial exclusion criterion:
Congenital or acquired thrombophilia/thrombosis event

Entity relations:
- Has_qualifier("thrombophilia", "Congenital")
- OR("Congenital", "acquired")
- OR("thrombophilia", "thrombosis event")